Clinical trial inclusion criterion:
Written consent must be provided prior to study entry.

Annotated entities:
- Informed_consent: "Written consent must be provided prior to study entry."